Clinical trial exclusion criterion:
Females who are pregnant as determined by positive pregnancy test on or before the day of surgery.

Annotated entities:
- Pregnancy_considerations: "Females who are pregnant as determined by positive pregnancy test on or before the day of surgery"